一位 50 歲男性，患有高血壓 5 年，從不治療。今日早晨去泡溫泉，突感劇烈撕裂性胸痛，冒冷汗。送至急診處，上臂動脈血壓 200/120 mmHg，左下肢動脈血壓 130/96 mmHg，右下肢動脈血壓 210/120 mmHg。 心電圖、troponin-I 正常。病人胸痛應最優先考慮那一種？
A. Non-ST elevation 之急性心肌梗塞
B. 肺栓塞（pulmonary embolism）
C. 主動脈剝離（aortic dissection）
D. 氣胸（pneumothorax）

正確答案：C. 主動脈剝離（aortic dissection）